Clinical trial exclusion criterion:
Histology other than glandular neoplasia,

Entity relations:
- Has_qualifier("glandular neoplasia", "other than")
- AND("Histology", "glandular neoplasia")